What is the purpose of HaploReg v4?

HaploReg v4 enables the systematic mining of putative causal variants, cell types, regulators and target genes for human complex traits and disease.